Autoimmune disease

The above is a clinical trial exclusion criterion. Annotated with entity spans:
[Condition: Autoimmune disease]